77歲中風病患，長期臥床且使用留置性導尿管。其看護發現尿液變臭且混濁持續三天，病患生命徵狀穩定，尿液檢查發現 WBC > 100/HPF，尿路培養為念珠球菌（Candida albicans），下列何項處置最不適當？
A. 給予口服fluconazole
B. 移除導尿管，改成每天定時間歇性清潔導尿（intermittent clean catheterization）
C. 給予amphotericin-B膀胱連續沖洗
D. 給予amphotericin-B靜脈注射

正確答案：D. 給予amphotericin-B靜脈注射